Clinical trial inclusion criterion:
Creatinine clearance = 60 ml/min (via Cockcroft-Gault formula)

Entity relations:
- Subsumes("Creatinine clearance", "Cockcroft-Gault formula")
- Has_value("Creatinine clearance", "= 60 ml/min")